有關舌骨（hyoid bone）的敘述，下列何者正確？
A. 為一環狀骨頭
B. 上咽縮肌（superior constrictor）附著於舌骨大角（greater horn of hyoid bone）
C. 其後端與會厭軟骨（epiglottis）相接
D. 約在第 3 頸椎的高度

正確答案：D. 約在第 3 頸椎的高度